Professional drivers, risk profession or respiratory failure (according to criteria of the clinical pathway for diagnosis and treatment of sleep-disordered breathing).

The above is a clinical trial exclusion criterion. Annotated with entity spans:
[Person: Professional drivers], [Person: risk profession] or [Condition: respiratory failure] (according to [Procedure: criteria of the clinical pathway for diagnosis and treatment of sleep-disordered breathing]).